P. C. es una mujer de 27 años que hace 3 semanas le administraron la primera dosis de la vacuna de VHB. Le acaban de dar los resultados de los marcadores serológicos de la rubeola: Ac anti rubeola negativos. Teniendo en cuenta la situación vacunal, ¿qué intervención es adecuada?:
1. Vacunar de la triple vírica y de la 2ª dosis del VHB, en el momento de la consulta.
2. Vacunar de la triple vírica en el momento de la consulta y esperar una semana para la administración de la 2ª dosis de la vacuna VHB.
3. Vacunar de la 2ª dosis de la vacuna VHB en el momento de la consulta y esperar una semana para la administración de la triple vírica.
4. Vacunar de la 2ª dosis de la vacuna VHB en el momento de la consulta, y no vacunar de la triple vírica ya que está inmunizada.
5. No vacunar por los AC anti rubeola negativos.

Respuesta correcta: 2. Vacunar de la triple vírica en el momento de la consulta y esperar una semana para la administración de la 2ª dosis de la vacuna VHB.